Clinical trial inclusion criteria:
Patients presenting for abdominal myomectomy with documented uterine fibroids on pelvic imaging (pelvic ultrasound or MRI) within in last 12 months
Age = 18 years and = 50 years
Pre-operative hemoglobin >8 g/dl
Willing to have buccal administration of misoprostol or a placebo at least one hour pre-procedure.
Ability to understand and the willingness to sign a written informed consent.
Admissible medical/surgical history
Can be previously treated with Depo-Lupron, Depo-Provera, or Oral Contraceptive pills
Intraoperative use of vasopressin and uterine tourniquet is permissible
Can have had prior Cesarean delivery

Annotated entities:
- Procedure: "abdominal myomectomy"
- Condition: "uterine fibroids"
- Procedure: "pelvic imaging"
- Procedure: "pelvic ultrasound"
- Procedure: "MRI pelvic"
- Temporal: "within in last 12 months"
- Person: "Age"
- Value: "= 18 years and = 50 years"
- Temporal: "Pre-operative"
- Reference_point: "operative"
- Procedure: "operative"
- Measurement: "hemoglobin"
- Value: ">8 g/dl"
- Procedure: "buccal administration"
- Drug: "misoprostol"
- Qualifier: "buccal administration"
- Drug: "placebo"
- Temporal: "at least one hour pre-procedure"
- Mood: "Willing to have"
- Observation: "Ability to understand a written informed consent"
- Observation: "willingness to sign a written informed consent"
- Temporal: "surgical history"
- Temporal: "medical history"
- Qualifier: "Admissible"
- Drug: "Depo-Lupron"
- Drug: "Depo-Provera"
- Drug: "Oral Contraceptive pills"
- Procedure: "treated"
- Temporal: "previously"
- Non-representable: "Intraoperative use of vasopressin and uterine tourniquet is permissible"
- Non-representable: "Can have had prior Cesarean delivery"